Clinical trial exclusion criterion:
Hypersensitivity to local anesthetics and/or Dexamethasone.

Entity relations:
- AND("Hypersensitivity", "local anesthetics")
- OR("local anesthetics", "Dexamethasone")